Clinical trial exclusion criterion:
Use intrauterine contraceptive device.

Annotated entities:
- Device: "intrauterine contraceptive device"